Clinical trial inclusion criterion:
serum alanine transaminase (ALT) ≤ 2.5 x ULN (in case of liver metastases < 5 x ULN)

Entity relations:
- Has_value("serum alanine transaminase (ALT)", "≤ 2.5 x ULN")
- Subsumes("≤ 2.5 x ULN", "liver metastases")
- Has_value("liver metastases", "< 5 x ULN")